Allergy to the vaccine compounds, as egg, neomycin and gelatin.

The above is a clinical trial exclusion criterion. Annotated with entity spans:
[Condition: Allergy to the vaccine compounds], as [Drug: egg], [Drug: neomycin] and [Drug: gelatin].